History or presence of clinically significant drug sensitivity or clinically significant allergic reaction to corticosteroids or salmeterol.

The above is a clinical trial exclusion criterion. Annotated with entity spans:
History or presence of clinically significant [Condition: drug sensitivity] or clinically significant [Condition: allergic reaction] to [Drug: corticosteroids] or [Drug: salmeterol].